下列何種受體在血管內皮細胞上被活化，會使內皮細胞釋放內皮衍生舒張因子（EDRF）而產生血管舒張作用？
A. Muscarinic M2
B. Muscarinic M3
C. Muscarinic M4
D. Nicotinic

正確答案：B. Muscarinic M3